Clinical trial exclusion criterion:
Infection at the site of block placement

Annotated entities:
- Condition: "Infection"
- Qualifier: "site of block placement"